Clinical trial exclusion criterion:
Accelerating angina or unstable angina

Entity relations:
- OR("Accelerating angina", "unstable angina")